Clinical trial inclusion criterion:
Patients scheduled for dental extraction and treated with edoxaban, apixaban, rivaroxaban or dabigatran

Entity relations:
- Has_mood("dental extraction", "scheduled for")
- OR("edoxaban", "apixaban", "rivaroxaban", "dabigatran")